What methodology does the FoundationOne CDx test use?

FoundationOne CDx is a next generation sequencing (NGS) based test.